Clinical trial inclusion criterion:
Schirmer: > 4 mm and < 14 mm

Entity relations:
- Has_value("Schirmer", "> 4 mm and < 14 mm")